How is CTCF activated post-translationally?

Poly(ADP-ribosyl)ation regulates CTCF-dependent chromatin insulation.  the chromatin insulator protein CTCF carries a post-translational modification: poly(ADP-ribosyl)ation Chromatin immunoprecipitation-on-chip analysis documented that the link between CTCF and poly(ADP-ribosyl)ation extended to more than 140 mouse CTCF target sites.